Which receptor is inhibited by Teprotumumab?

Teprotumumab is a monoclonal inhibitory antibody targeting IGF-1 receptor.